Clinical trial inclusion criterion:
Area within each school district that is in need of a well

Annotated entities:
- Visit: "school district that is in need of a well"